An active or a history of a psychiatric disorder including, but not limited to, depression, schizophrenia, bipolar disorder, anxiety, or other psychiatric disorders;

The above is a clinical trial exclusion criterion. Annotated with entity spans:
An [Qualifier: active] or a [Temporal: history] of a [Condition: psychiatric disorder] including, but not limited to, [Condition: depression], [Condition: schizophrenia], [Condition: bipolar disorder], [Condition: anxiety], or [Qualifier: other] [Condition: psychiatric disorders];